Which are the uses of deep learning models in Duchenne Muscular Dystrophy?

Deep learning models enable the evaluation of DMD patients using ultrasound images.